想要受孕，下列何者是推算同房時間最好的方法？
A. 基礎體溫表溫度改變的時間
B. 尿液測 LH（luteinizing hormone）
C. 血清中progesterone濃度
D. 子宮頸分泌物變多，變稀時

正確答案：B. 尿液測 LH（luteinizing hormone）